Clinical trial exclusion criterion:
diagnosis of schizophrenia or presence of thought disorder symptoms

Entity relations:
- Has_mood("thought disorder", "symptoms")
- OR("schizophrenia", "thought disorder")